補體（complement）活化過程中產生之 C3 convertase 能分解 C3，製造大量 C3a 及 C3b。其中 C3b 之功能為何？
A. 引起局部發炎反應，吸引巨噬細胞（macrophage）、嗜中性細胞（neutrophil）來到該部位
B. 在病原菌表面形成共價鍵連結，表現 C3b 之病原菌就容易被吞噬細胞（phagocytes）吞噬
C. 直接攻擊病原菌之細胞膜
D. 分解 C4 成為 C4a 及 C4b

正確答案：B. 在病原菌表面形成共價鍵連結，表現 C3b 之病原菌就容易被吞噬細胞（phagocytes）吞噬